Clinical trial exclusion criterion:
severe cardiovascular disease, liver and kidney disease, and complications of diabetes

Entity relations:
- Has_qualifier("cardiovascular disease", "severe")
- AND("complications", "diabetes")
- OR("cardiovascular disease", "liver disease", "complications", "kidney disease")